Clinical trial exclusion criterion:
Has been in receipt of any licensed vaccine within 14 days prior to the first dose of study vaccine/placebo, plans to receive within 14 days after the first study vaccination, or plans to receive within 14 days before or after the second, third or fourth vaccination

Annotated entities:
- Drug: "licensed vaccine"
- Temporal: "within 14 days prior"
- Reference_point: "the first dose of study vaccine/placebo"
- Temporal: "within 14 days after"
- Reference_point: "first study vaccination"
- Drug: "study vaccine"
- Drug: "placebo"
- Procedure: "study vaccination"
- Non-query-able: "plans to"
- Temporal: "within 14 days before or after"
- Reference_point: "second, third or fourth vaccination"
- Drug: "vaccination"
- Non-query-able: "plans to"